Diagnosis of emphysema confirmed by CT scan. If a report of past CT scan is not available at site documenting then a CT scan is to be performed at screening

The above is a clinical trial inclusion criterion. Annotated with entity spans:
Diagnosis of [Condition: emphysema] confirmed by [Procedure: CT scan]. If a [Observation: report of past CT scan] is [Negation: not available] at site documenting then a [Procedure: CT scan] is to be performed [Temporal: at screening]